Clinical trial inclusion criterion:
Females undergoing Intra-Cytoplasmic Sperm Injection (ICSI) cycles

Entity relations:
- Has_temporal("Intra-Cytoplasmic Sperm Injection (ICSI) cycles", "undergoing")